治療愛滋病（AIDS）的藥物疊氮胸苷（azidothymidine, AZT），是針對病毒那個基因的產物？
A. env
B. gag
C. tat
D. pol

正確答案：D. pol